Clinical trial inclusion criterion:
Received a new or ongoing prescription for at least one SGA (i.e., olanzapine, clozapine, risperidone, quetiapine, aripiprazole, ziprasidone, iloperidone, lurasidone, paliperidone, brexpiprazole or cariprazine) that is not prescribed as a PRN medication;

Annotated entities:
- Multiplier: "at least one"
- Drug: "SGA"
- Drug: "olanzapine"
- Drug: "clozapine"
- Drug: "risperidone"
- Drug: "quetiapine"
- Drug: "aripiprazole"
- Drug: "ziprasidone"
- Drug: "iloperidone"
- Drug: "lurasidone"
- Drug: "paliperidone"
- Drug: "brexpiprazole"
- Drug: "cariprazine"